Has a neuromuscular disorder that may affect NMB and/or trial assessments.

The above is a clinical trial exclusion criterion. Annotated with entity spans:
Has a [Condition: neuromuscular disorder] that may [Observation: affect NMB] and/or trial assessments.